Clinical trial exclusion criterion:
taken of corticosteroid in the last month

Entity relations:
- Has_temporal("corticosteroid", "last month")